細胞質性抗中性球細胞質抗體（cytoplasmic anti-neutrophil cytoplasmic antibodies, c-ANCA）常見於何種疾病？
A. 巨細胞動脈炎
B. 川崎（Kawasaki）氏病
C. Henoch-Schönlein 紫斑症
D. Wegener 氏肉芽腫症

正確答案：D. Wegener 氏肉芽腫症